Clinical trial exclusion criterion:
Previous anaphylaxis following any component of Bexsero vaccine

Entity relations:
- AND("anaphylaxis", "Bexsero vaccine")
- Has_temporal("anaphylaxis", "Previous")